Clinical trial inclusion criterion:
Signed Informed Consent Form (ICF).

Annotated entities:
- Post-eligibility: "Signed Informed Consent Form (ICF)"